Clinical trial exclusion criteria:
Non diabetic nephropathy (confirmed by biopsy).
Dialysis for acute renal failure within the 6 previous months.
Evidence in the clinic history of relevant bilateral stenosis of renal artery (> 75%)
Urinary albumin/creatinine ratio higher than 3000 mg/g, at the baseline visit.
Systolic blood pressure = 180 mmHg or diastolic blood pressure = 110 mm Hg at the baseline visit.
Stroke, transient ischemic attack, acute coronary syndrome, or hospitalization for heart failure worsening, within the previous 30 days.
Professional drivers, risk profession or respiratory failure.
Severe daytime sleepiness (Epworth sleepiness scale >18)
Concomitant treatment with high doses of acetylsalicylic acid (> 500 mg/day) or continuous treatment with non-steroidal anti-inflammatory drugs
Previous treatment with CPAP
Participation in another clinical trial within the 30 days prior to randomization.

Annotated entities:
- Condition: "Non diabetic nephropathy"
- Qualifier: "confirmed by biopsy"
- Procedure: "biopsy"
- Procedure: "Dialysis"
- Condition: "acute renal failure"
- Temporal: "within the 6 previous months"
- Qualifier: "relevant"
- Qualifier: "bilateral"
- Condition: "stenosis of renal artery"
- Value: "> 75%"
- Measurement: "Urinary albumin/creatinine ratio"
- Value: "higher than 3000 mg/g"
- Temporal: "at the baseline visit"
- Measurement: "Systolic blood pressure"
- Value: "= 180 mmHg"
- Measurement: "diastolic blood pressure"
- Value: "= 110 mm Hg"
- Temporal: "at the baseline visit"
- Condition: "Stroke"
- Condition: "transient ischemic attack"
- Condition: "acute coronary syndrome"
- Procedure: "hospitalization"
- Condition: "heart failure"
- Qualifier: "worsening"
- Temporal: "within the previous 30 days"
- Person: "Professional drivers"
- Person: "risk profession"
- Condition: "respiratory failure"
- Qualifier: "Severe"
- Condition: "daytime sleepiness"
- Measurement: "Epworth sleepiness scale"
- Value: ">18"
- Temporal: "Concomitant"
- Procedure: "treatment"
- Multiplier: "high doses"
- Drug: "acetylsalicylic acid"
- Multiplier: "> 500 mg/day"
- Temporal: "continuous"
- Procedure: "treatment"
- Drug: "non-steroidal anti-inflammatory drugs"
- Temporal: "Previous"
- Procedure: "treatment"
- Device: "CPAP"
- Non-query-able: "Participation in another clinical trial within the 30 days prior to randomization."